Uncontrolled asthma;

The above is a clinical trial exclusion criterion. Annotated with entity spans:
[Qualifier: Uncontrolled] [Condition: asthma];